Clinical trial inclusion criteria:
Age: 20-70 years old;
Gender: male or female;
clinical or pathological diagnosis of hepatocellular carcinoma (HCC) in previously untreated patients;
The expected survival> 3 months;
Child-Pugh grade in A-level;
KPS score with 50-100 points;
BCLC stage of 0-B;
conform to the indications of hepatectomy;
Viable tumor resection confirmed by two highly qualified surgical doctors;
No other surgical contraindications.
women in the reproductive period must be completely contraception in 28 days before treatment, during the treatment process and in 28 days after treatment;
Men must be completely contraception and prohibited donation and sperm donation during the treatment process and in 28 days after treatment;
All patients must be prohibited donation during the treatment process and in 28 days after treatment;
In addition to the subjects, prohibitting other people taking this product.
patients have a good understanding and could coordinate with investigators for the trial.
Patients enrolled in the trial should sign an informed consent form, to indicate understanding the purpose and procedure of the trial, and patients volunteering to participate in the trial.

Annotated entities:
- Person: "Age"
- Value: "20-70 years old"
- Person: "Gender"
- Value: "male"
- Value: "female"
- Condition: "hepatocellular carcinoma"
- Qualifier: "clinical or pathological diagnosis"
- Condition: "HCC"
- Qualifier: "untreated"
- Observation: "expected survival"
- Value: "> 3 months"
- Measurement: "Child-Pugh grade"
- Value: "A"
- Measurement: "KPS score"
- Value: "50-100 points"
- Measurement: "BCLC stage"
- Value: "0-B"
- Procedure: "hepatectomy"
- Observation: "indications of hepatectomy"
- Subjective_judgement: "Viable tumor resection confirmed by two highly qualified surgical doctors"
- Negation: "No"
- Observation: "other surgical contraindications"
- Person: "women"
- Observation: "reproductive period"
- Procedure: "contraception"
- Temporal: "in 28 days before treatment"
- Reference_point: "treatment"
- Temporal: "during the treatment process"
- Temporal: "in 28 days after treatment"
- Reference_point: "treatment"
- Reference_point: "treatment"
- Person: "Men"
- Procedure: "contraception"
- Negation: "prohibited"
- Procedure: "sperm donation"
- Temporal: "during the treatment process"
- Temporal: "in 28 days after treatment"
- Reference_point: "treatment"
- Reference_point: "treatment"
- Procedure: "donation"
- Negation: "prohibited"
- Procedure: "donation"
- Temporal: "during the treatment process"
- Reference_point: "treatment"
- Temporal: "in 28 days after treatmen"
- Reference_point: "treatment"
- Undefined_semantics: "In addition to the subjects, prohibitting other people taking this product"
- Subjective_judgement: "patients have a good understanding and could coordinate with investigators for the trial"
- Post-eligibility: "Patients enrolled in the trial should sign an informed consent form, to indicate understanding the purpose and procedure of the trial, and patients volunteering to participate in the trial"